Teniendo en cuenta las relaciones entre la teoría de los cuatro temperamentos y el modelo de personalidad de H.J. Eysenck, un temperamento colérico corresponderá a una persona:
1. Introvertida y Estable Emocional.
2. Apática y Estable Emocional.
3. Introvertida e Inestable Emocional.
4. Extrovertida e Inestable Emocional.
5. Introvertida y Ansiosa.

Respuesta correcta: 4. Extrovertida e Inestable Emocional.